Clinical trial inclusion criterion:
Patient with coronary artery disease

Annotated entities:
- Condition: "coronary artery disease"